The patient must have severe, symptomatic (ACC/AHA Stage D symptoms) tricuspid regurgitation (TR) as assessed by 2D echocardiogram with evidence of peripheral and central venous congestion (specifically lower extremity edema and abdominal ascites requiring diuretics.)

The above is a clinical trial inclusion criterion. Annotated with entity spans:
The patient must have [Qualifier: severe], [Qualifier: symptomatic] ([Measurement: ACC/AHA] [Value: Stage D] symptoms) [Condition: tricuspid regurgitation] ([Condition: TR]) as assessed by [Procedure: 2D echocardiogram] with evidence of [Condition: peripheral] and [Condition: central venous congestion] (specifically [Condition: lower extremity edema] and [Condition: abdominal ascites] requiring [Drug: diuretics].)